patient infected by multi drug resistant Gram negative bacteria susceptibly only to colistin

The above is a clinical trial inclusion criterion. Annotated with entity spans:
patient infected by [Qualifier: multi drug resistant] [Condition: Gram negative bacteria] [Observation: susceptibly] [Multiplier: only] to [Drug: colistin]